Clinical trial inclusion criterion:
Current glucose lowering therapy either mono, dual or triple of any combination of metformin, sulphonylurea, DPP-IV inhibitor, GLP-1 therapy or an SGLT2 +/- diet and exercise

Entity relations:
- Subsumes("glucose lowering therapy", "metformin")
- OR("metformin", "sulphonylurea", "DPP-IV inhibitor,", "GLP-1 therapy", "SGLT2", "diet", "exercise")